Clinical trial exclusion criterion:
Patients with abnormal coagulation or any other contra-indication to use of standard biopsy in routine diagnostic endoscopic procedures

Entity relations:
- AND("contra-indication", "standard biopsy")
- OR("abnormal coagulation", "contra-indication")